關於 C 型肝炎的傳染途徑，下列何者錯誤？
A. C 型肝炎和 B 型肝炎一樣是經由體液及血液感染
B. 過去輸注血液或血漿製品是重要的傳染途徑
C. 其他傳染途徑如性行為，家庭內接觸亦很常見
D. 哺育母乳不會傳染 C 型肝炎病毒

正確答案：C. 其他傳染途徑如性行為，家庭內接觸亦很常見